La microbiota vaginal de una mujer sana fértil está dominada por bacterias del género:
1. Peptostreptococcus.
2. Bifidobacterium.
3. Eubacterium.
4. Lactobacillus.
5. Vagococcus.

Respuesta correcta: 4. Lactobacillus.